下列何者常見低頻聽力損失？
A. 老年性聽力損失
B. 音響損傷
C. 梅尼爾氏病
D. 耳毒症

正確答案：C. 梅尼爾氏病